Known hypersensitivity to the trial treatment(s) or diluents (when applicable), including placebo or other comparator drug(s).

The above is a clinical trial exclusion criterion. Annotated with entity spans:
Known [Condition: hypersensitivity] to the [Procedure: trial treatment(s)] or diluents (when applicable), including [Drug: placebo] or [Qualifier: other] [Drug: comparator drug(s)].